Clinical trial exclusion criterion:
Patient has symptoms of or been diagnosed with a medical condition that may contribute to abdominal pain

Annotated entities:
- Condition: "medical condition"
- Qualifier: "may contribute to abdominal pain"
- Condition: "abdominal pain"